La hidrólisis del fosfatidilinositol 4,5- bisfosfato (PIP2) por parte de la fosfolipasa C genera los siguientes segundos mensajeros:
1. Inositol 1,4,5-trisfosfato y triacilglicerol.
2. Inositol 1,4, 5-trisfosfato y glicerol.
3. Inositol 1,4, 5-trisfosfato y diacilglicerol.
4. Inositol 4,5-bisfosfato y diacilglicerol.
5. Inositol 4,5-bisfosfato y glicerol.

Respuesta correcta: 3. Inositol 1,4, 5-trisfosfato y diacilglicerol.